Patient has provided signed informed consent

The above is a clinical trial inclusion criterion. Annotated with entity spans:
Patient has provided [Observation: signed informed consent]